有關肛門的 Paget 氏病之敘述，何者為非？
A. 是一種老年人較為多見的腺癌
B. 一半以上的病人伴有其他潛藏的癌症
C. 與肛門的濕疹、角化過度等很容易鑑別
D. 組織學上一定要有 PAS(+)的 Paget 氏細胞才可確立診斷

正確答案：C. 與肛門的濕疹、角化過度等很容易鑑別